Lumbar spinal surgery within the preceding six months

The above is a clinical trial exclusion criterion. Annotated with entity spans:
[Procedure: Lumbar spinal surgery] [Temporal: within the preceding six months]